Clinical trial inclusion criterion:
The ascertained lead impedance is between 200 and 1500 Ohm.

Annotated entities:
- Measurement: "ascertained lead impedance"
- Value: "between 200 and 1500 Ohm"